厭水性分析圖（hydropathy plot）一般可用於：
A. 推算膜蛋白質的四級結構
B. 測定天然的蛋白質（native protein）的水含量
C. 推算膜蛋白質的實際分子量
D. 預測已知的蛋白質胺基酸序列是否含有穿膜區（membrane-spanning segment）

正確答案：D. 預測已知的蛋白質胺基酸序列是否含有穿膜區（membrane-spanning segment）